假使你在內科加護病房值班，一位 65 歲心肌梗塞的病人突然喪失生命跡象，心電圖顯示心室顫動（ventricular fibrillation）。此時你手邊有一台單相波電擊器（monophasic defibrillator），接下來該怎麼辦？
A. 將電擊器調到 200 焦耳（Joules），電擊後如沒反應繼續往上調至 300 焦耳或 360 焦耳再電擊
B. 將電擊器調到 200 焦耳，連續電擊三次後立即做心肺復甦術
C. 將電擊器調到 360 焦耳，電擊一次後立即做心肺復甦術
D. 將電擊器調到 200 焦耳，電擊一次後立即做心肺復甦術

正確答案：C. 將電擊器調到 360 焦耳，電擊一次後立即做心肺復甦術